Clinical trial inclusion criterion:
Hematologic function, as follows: Absolute neutrophil count (ANC) >=1.5 x 10^9/Liter (L), Platelet count >=75 x 10^9/L, Hemoglobin >=8.0 gram/deciliter (g/dL).

Annotated entities:
- Measurement: "Absolute neutrophil count (ANC)"
- Value: ">=1.5 x 10^9/Liter (L)"
- Measurement: "Platelet count"
- Value: ">=75 x 10^9/L"
- Measurement: "Hemoglobin"
- Value: ">=8.0 gram/deciliter (g/dL)"